Clinical trial inclusion criterion:
3. At least 2 lesions (located in different vessels and in different territories) potentially amenable to stent implantation;

Annotated entities:
- Value: "At least 2"
- Condition: "lesions"
- Qualifier: "located in different vessels"
- Qualifier: "located in different territories"
- Procedure: "stent implantation"
- Observation: "potentially amenable"